Clinical trial exclusion criterion:
WBC <3 K/cumm

Annotated entities:
- Measurement: "WBC"
- Value: "<3 K/cumm"